¿A qué tipo de patología corresponde la diabetes de tipo I insulinodependiente?
1. Inmunodeficiencia congénita.
2. Enfermedad autoinmune.
3. Hipersensibilidad mediada por IgE.
4. Hipersensibilidad debida a inmunocomplejos.
5. Síndrome inmunoproliferativo.

Respuesta correcta: 2. Enfermedad autoinmune.